Clinical trial inclusion criterion:
4. Morphologically documented primary AML or AML secondary to myelodysplastic syndrome (MDS with ≥20% bone marrow or peripheral blasts), as defined by the World Health Organization (WHO) criteria, confirmed by pathology review at treating institution.

Annotated entities:
- Qualifier: "Morphologically documented"
- Qualifier: "primary"
- Condition: "AML"
- Condition: "AML"
- Condition: "myelodysplastic syndrome"
- Condition: "MDS"
- Value: "≥20%"
- Measurement: "bone marrow"
- Measurement: "peripheral blasts"
- Procedure: "World Health Organization (WHO) criteria"
- Procedure: "pathology review"